罹患頭痛的小孩，出現以下何種情形時，最需要做神經影像檢查？
A. 頭痛持續一個小時以上
B. 出現發燒
C. 有局部不正常神經學徵兆（Focal neurological sign）
D. 有偏頭痛（Migraine）家族史

正確答案：C. 有局部不正常神經學徵兆（Focal neurological sign）